Clinical trial exclusion criterion:
Acquired deficiency of coagulation factors whose treatment is established

Entity relations:
- Has_qualifier("Acquired deficiency of coagulation factors", "whose treatment is established")